Clinical trial exclusion criterion:
Inflammatory bowel disease that is uncontrolled or on active treatment (Crohn's disease, ulcerative colitis)

Annotated entities:
- Condition: "Inflammatory bowel disease"
- Qualifier: "uncontrolled"
- Procedure: "treatment"
- Condition: "Crohn's disease"
- Condition: "ulcerative colitis"